一位 5 歲的小孩，經常咳到滿臉通紅甚至嘔吐，且伴隨有頭痛、發燒及喉嚨痛等症狀而求診。經聽診後，發現肺部有雜音，X 光則顯示下肺葉部出現斑塊狀的「間質性肺炎」陰影，因此懷疑是黴漿菌（Mycoplasma）感染。可以用下列何種藥物進行治療？
A. 萬古黴素（vancomycin）
B. 青黴素（penicillin）
C. 四環黴素（tetracycline）
D. 枯草桿菌素（bacitracin）

正確答案：C. 四環黴素（tetracycline）